Which are the side effects during tacrine administration in patients with Alzheimer's Disease?

The side effects during tacrine administration in patients with Alzheimer's Disease are:
1) Hepatotoxicity
2) Gastrointestinal (diarrhea, anorexia, dyspepsia, abdominal pain, nausea, vomiting)
3) Mitochondrial impairement